A la hora de realizar una entrevista a una persona, con el fin de recabar información sobre su situación, es fundamental tener en cuenta que:
1. Una distancia de 20 cm., hace que la persona se sienta más cómoda y facilite mayor información.
2. El espacio adecuado para cada persona depende de sus necesidades personales y culturales.
3. El contacto físico simple, como poner la mano sobre la persona entrevistada, siempre es apropiado.
4. Las mujeres generalmente demandan más espacio que los hombres.
5. La ansiedad hace que la necesidad de espacio sea menor.

Respuesta correcta: 2. El espacio adecuado para cada persona depende de sus necesidades personales y culturales.